Clinical trial inclusion criterion:
At least one top quality embryo

Entity relations:
- Has_value("top quality embryo", "At least one")